Describe crowned dens syndrome.

Crowned dens syndrome is a rare form of "crown-like" calcifications around the dens and often presents with recurrent neck pain, stiffness of neck, increased erythrocyte sedimentation rate, and episodes of fever.